Clinical trial exclusion criterion:
received interferon or peginterferon treatment in the past.

Annotated entities:
- Drug: "interferon"
- Drug: "peginterferon"
- Procedure: "treatment"
- Temporal: "in the past"